Clinical trial exclusion criterion:
Pregnant or breast-feeding subjects

Entity relations:
- OR("Pregnant", "breast-feeding")